Según la Ley General de Sanidad 14/1986 de 25 de abril, el marco territorial de la Atención Primaria de Salud es:
1. El Distrito de Salud.
2. El Área de Salud.
3. La Zona Básica de Salud.
4. El Primer Nivel Asistencial.
5. El Centro de Atención Primaria.

Respuesta correcta: 3. La Zona Básica de Salud.